Unable to undergo brain MRI

The above is a clinical trial exclusion criterion. Annotated with entity spans:
[Mood: Unable to undergo] [Procedure: brain MRI]